下列何者與內收長肌（adductor longus）由相同的神經支配？
A. 股薄肌（gracilis）
B. 股方肌（quadratus femoris）
C. 恥骨肌（pectineus muscle）
D. 閉孔內肌（obturator internus）

正確答案：A. 股薄肌（gracilis）